Clinical trial inclusion criterion:
Moderate to advanced generalized chronic periodontitis

Annotated entities:
- Qualifier: "Moderate to advanced"
- Condition: "generalized chronic periodontitis"